Which gene harbors the mutation T790M?

The T790M mutation refers to the mutation in exon 20 of the EGFR gene